Which dediodinases are present in kidney?

Type 1 and  Type 3 deiodinases are both present in liver